Clinical trial exclusion criterion:
9. Previous myocardial infarction in the distribution of the target vessel for the FFR

Annotated entities:
- Parsing_Error: "9."
- Condition: "myocardial infarction"
- Temporal: "Previous"
- Qualifier: "in the distribution of the target vessel"